Clinical trial inclusion criterion:
Family have a freezer in which to safely store the test meals.

Annotated entities:
- Non-query-able: "Family have a freezer in which to safely store the test meals"